Los conos:
1. Están preferentemente en la retina periférica.
2. Tienen discos membranosos apilados en su segmento externo.
3. Tienen menor sensibilidad que los bastones.
4. Sinaptan con neuronas ganglionares.
5. Sinaptan sólo sobre bipolares de centro “on”.

Respuesta correcta: 3. Tienen menor sensibilidad que los bastones.